Clinical trial inclusion criterion:
American Society of Anesthesiologist (ASA) status I-II adult patients undergoing elective laparoscopic cholecystectomy.

Entity relations:
- Has_value("American Society of Anesthesiologist (ASA)", "status I-II")
- Has_qualifier("laparoscopic cholecystectomy", "elective")